Pregnant women or women planning to become pregnant

The above is a clinical trial exclusion criterion. Annotated with entity spans:
[Pregnancy_considerations: Pregnant women or women planning to become pregnant]